Clinical trial inclusion criteria:
Patients undergoing SSRF at Denver Health Medical Center

Annotated entities:
- Procedure: "SSRF"
- Visit: "Denver Health Medical Center"